下列那個情況會造成胃液分泌下降？
A. intrinsic factor分泌增加
B. 迷走神經釋放乙醯膽鹼（ACh）
C. 十二指腸的腸嗜鉻細胞（enterochromaffin cells）釋放血清素（serotonin）
D. 食物從胃排空到十二指腸

正確答案：D. 食物從胃排空到十二指腸